Lifetime history of 5 or more migraine or probable migraine headaches pre-dating mTBI

The above is a clinical trial exclusion criterion. Annotated with entity spans:
[Temporal: Lifetime history] of [Multiplier: 5 or more] [Condition: migraine] or [Qualifier: probable] [Condition: migraine] headaches [Temporal: pre-dating mTBI]